Clinical trial inclusion criterion:
HEALTHY: normal cardiac structure and function on echocardiography, BP < 140/90

Annotated entities:
- Condition: "HEALTHY"
- Value: "normal cardiac structure"
- Value: "normal cardiac function"
- Procedure: "echocardiography"
- Measurement: "BP"
- Value: "< 140/90"